Clinical trial inclusion criterion:
Able and willing to personally comply with and execute all aspects of the study requirements for the caregivers or guardians

Annotated entities:
- Observation: "willing to personally comply"
- Observation: "Able to personally comply"
- Person: "caregivers"
- Person: "guardians"